Clinical trial exclusion criterion:
Combined P-glycoprotein inducer and strong CYP 3A4 inducer

Annotated entities:
- Drug: "P-glycoprotein inducer"
- Drug: "CYP 3A4 inducer"
- Qualifier: "strong"